Clinical trial exclusion criterion:
Body Mass Index > 40;

Entity relations:
- Has_value("Body Mass Index", "> 40")